Clinical trial exclusion criterion:
History of gastrectomy, short bowel syndrome;

Annotated entities:
- Procedure: "gastrectomy"
- Condition: "short bowel syndrome"
- Temporal: "History"